Which is the main component of the Lewy body?

Lewy bodies comprise of aggregated intracellular vesicles and proteins and α-synuclein is reported to be a major protein component.